Clinical trial exclusion criterion:
4. Past diagnosis of major depression, schizophrenia, major anxiety syndrome, or manic- depressive illness.

Annotated entities:
- Parsing_Error: "4."
- Condition: "major depression"
- Condition: "schizophrenia"
- Condition: "major anxiety syndrome"
- Condition: "manic- depressive illness"
- Observation: "Past diagnosis"